No other melanoma treatment during the protocol.

The above is a clinical trial inclusion criterion. Annotated with entity spans:
No other [Condition: melanoma] [Procedure: treatment] [Temporal: during the protocol].